Indication for emergent cesarean or known fetal anomaly

The above is a clinical trial exclusion criterion. Annotated with entity spans:
[Condition: Indication] for [Procedure: emergent cesarean] or known [Condition: fetal anomaly]